¿Cuál de las siguientes enfermedades NO se transmite por picadura de garrapatas?
1. Enfermedad de Lyme.
2. Fiebre recurrente por Borrelia hispanica.
3. Fiebre botonosa mediterránea.
4. Fiebre maculosa de las montañas rocosas por R. rickettsii.
5. Tifus exantemático.

Respuesta correcta: 5. Tifus exantemático.